Patient is expecting or has had major cardiac surgery within last two months.

The above is a clinical trial exclusion criterion. Annotated with entity spans:
Patient is expecting or has had [Procedure: major cardiac surgery] within [Temporal: last two months].